Current use of systemic steroids >20 mg QD prednisone (or equivalent)

The above is a clinical trial exclusion criterion. Annotated with entity spans:
Current use of [Drug: systemic steroids] [Multiplier: >20 mg QD] [Drug: prednisone] (or equivalent)